Moderate or severe COPD exacerbation (requiring corticosteroids or increased dosage of corticosteroids and/or antibiotics or hospitalization) within the 4 weeks prior to Visit 1

The above is a clinical trial exclusion criterion. Annotated with entity spans:
[Qualifier: Moderate] or [Qualifier: severe] [Condition: COPD exacerbation] (requiring [Drug: corticosteroids] or [Qualifier: increased dosage] of [Drug: corticosteroids] and/or [Drug: antibiotics] or [Visit: hospitalization]) [Temporal: within the 4 weeks prior to Visit 1]